Inability to understand and read English.

The above is a clinical trial exclusion criterion. Annotated with entity spans:
[Observation: Inability to understand and read English].